一位61歲男性慢性B型肝炎病人，經檢查發現在肝臟右葉有兩個肝細胞癌，直徑分別為4公分與3.5公分，左葉亦有一個肝細胞癌，直徑為1.5公分，主肝門靜脈暢通，病人肝功能Child-Pugh分級為A。在臺灣此病人最適當之初步治療方式為何？
A. 肝腫瘤切除術
B. 標靶藥物治療
C. 肝移植手術
D. 經肝動脈栓塞治療術

正確答案：D. 經肝動脈栓塞治療術